¿Cuál de las siguientes proteínas señalizadoras está presente en mamíferos, vegetales y bacterias?:
1. Calmodulina.
2. Adenidil ciclasa.
3. Proteína quinasa A.
4. Receptores tirosina quinasa.

Respuesta correcta: 2. Adenidil ciclasa.